Clinical trial exclusion criterion:
Subjects who have received any HDAC inhibitors other than valproic acid

Annotated entities:
- Drug: "HDAC inhibitors"
- Negation: "other than"
- Drug: "valproic acid"